Clinical trial inclusion criterion:
Have stable COPD medication within 4 weeks prior to Visit 1 (no new medication added and no dosage changes in medication).

Annotated entities:
- Drug: "COPD medication"
- Temporal: "within 4 weeks prior to Visit 1"
- Qualifier: "stable"